一個月大的男嬰餵奶後出現有噴射性的嘔吐現象，其吐出物中不含膽汁。理學檢查在上腹部可摸到一類似橄欖狀的腫塊（olive mass），最可能的診斷為：
A. 膽道囊腫（choledochal cyst）
B. 腸	疊（intussusception）
C. 嬰兒型幽門肥厚狹窄（infantile hypertrophic pyloric stenosis）
D. 巨大結腸症（megacolon）

正確答案：C. 嬰兒型幽門肥厚狹窄（infantile hypertrophic pyloric stenosis）